Clinical trial inclusion criteria:
Patient with spontaneous intracranial hemorrhage or traumatic intracranial hemorrhage or patient requiring neurological surgery
Coagulation disorder defined by PT less than 60%

Annotated entities:
- Condition: "spontaneous intracranial hemorrhage"
- Condition: "traumatic intracranial hemorrhage"
- Mood: "requiring"
- Procedure: "neurological surgery"
- Condition: "Coagulation disorder"
- Measurement: "PT"
- Value: "less than 60%"